Neurological disease

The above is a clinical trial inclusion criterion. Annotated with entity spans:
[Condition: Neurological disease]